Clinical trial inclusion criterion:
Diagnosis of comorbid DSM-IV major depressive episode will be allowed in the study provided that the diagnosis is secondary to OCD, they have a baseline Montgomery Depression Rating Scale (MADRS) score of less than or equal to 19, and the onset of OCD predates the onset of the current episode of depression by five or more years.

Annotated entities:
- Condition: "major depressive episode"
- Qualifier: "DSM-IV"
- Qualifier: "comorbid"
- Condition: "OCD"
- Measurement: "Montgomery Depression Rating Scale"
- Qualifier: "baseline"
- Measurement: "MADRS"
- Value: "score of less than or equal to 19"
- Condition: "onset of OCD"
- Temporal: "predates the onset of the current episode of depression by five or more years"
- Reference_point: "onset of the current episode of depression"